diabetes mellitus

The above is a clinical trial exclusion criterion. Annotated with entity spans:
[Condition: diabetes mellitus]